Clinical trial exclusion criterion:
Patients who have been previously treated with radioactive directed therapies

Entity relations:
- Has_temporal("radioactive directed therapies", "previously")